Patients with a history of coronary artery disease, valvular or hypertensive heart disease

The above is a clinical trial exclusion criterion. Annotated with entity spans:
Patients with a [Temporal: history] of [Condition: coronary artery disease], valvular or [Condition: hypertensive heart disease]